Clinical trial exclusion criterion:
Any physical or intellectual disability adversely affecting ability to complete assessments

Annotated entities:
- Condition: "intellectual disability"
- Condition: "physical disability"